La aparición de fiebre elevada de 39ºC en un lactante de 10 meses que cede bruscamente después de 3-5 días, seguido de un exantema morbiliforme cefalocaudal con enantema constituido por pápulas rojizas en paladar, y que se resuelve en una semana, asociado a buen estado general, suele estar producido por:
1. Parvovirus B19.
2. Herpes virus tipo 6.
3. Virus Coxackie A16.
4. Primoinfección por virus de Epstein-Barr.

Respuesta correcta: 2. Herpes virus tipo 6.